Clinical trial inclusion criteria:
All subjects underwent a detailed history and systemic physical examination including neurologic and musculoskeletal evaluations. To rule out any confounding etiologies, basic diagnostic laboratory tests including complete blood count and acute phase reactants (erythrocyte sedimentation rate and C-reactive protein) were performed. The patients diagnosed as having acute non-specific low back pain according to history and physical examinations were invited to participate and will be informed about the purpose and course of the study.
A primary complaint of pain in the area between the 12th rib and buttock crease without leg pain
Female or male, 20 - 80 years of age
Low back pain of less than six weeks' duration; and at least moderate pain intensity (NRS<U+2267>4)

Annotated entities:
- Qualifier: "acute"
- Condition: "non-specific low back pain"
- Procedure: "physical examinations"
- Temporal: "history"
- Non-representable: "All subjects underwent a detailed history and systemic physical examination including neurologic and musculoskeletal evaluations."
- Procedure: "complete blood count"
- Procedure: "acute phase reactants"
- Procedure: "erythrocyte sedimentation rate"
- Procedure: "C-reactive protein"
- Procedure: "diagnostic laboratory tests"
- Condition: "pain"
- Qualifier: "area between the 12th rib and buttock crease"
- Condition: "leg pain"
- Negation: "without"
- Person: "Female"
- Person: "male"
- Value: "20 - 80 years"
- Person: "age"
- Condition: "Low back pain"
- Temporal: "less than six weeks' duration"
- Value: "at least moderate"
- Measurement: "pain intensity"
- Measurement: "NRS"
- Value: "4"